下列抗癌藥物中何者號稱為紡錘體的毒藥（mitotic spindle poison），讓紡錘絲之tubulin穩定聚合不易散去，進而破壞有絲分裂（mitosis）過程？
A. busulfan
B. cisplatin
C. 6-mercaptopurine
D. paclitaxel

正確答案：D. paclitaxel